Ongoing cord compression or a syrinx in the spinal cord or who suffer from a spinal cord disease such as spinal stenosis, spina bifida or herniated cervical disk.

The above is a clinical trial exclusion criterion. Annotated with entity spans:
Ongoing [Condition: cord compression] or a [Condition: syrinx] in the [Qualifier: spinal cord] or who suffer from a [Condition: spinal cord disease] such as [Condition: spinal stenosis], [Condition: spina bifida] or [Condition: herniated cervical disk].